Intra parenchymatous hematoma

The above is a clinical trial inclusion criterion. Annotated with entity spans:
[Qualifier: Intra parenchymatous] [Condition: hematoma]